Presence of psychiatric disorder or intake of anti-depressive or anti-psychotic agents with the exception of benzodiazepines and SSRIs/SNRI's (selective serotonin reuptake inhibitor)

The above is a clinical trial exclusion criterion. Annotated with entity spans:
Presence of [Condition: psychiatric disorder] or intake of [Drug: anti-depressive] or [Drug: anti-psychotic agents] [Negation: with the exception of] [Drug: benzodiazepines] and [Drug: SSRIs]/[Drug: SNRI's] (selective serotonin reuptake inhibitor)